黃先生在老人院擔任管理員，常對家人表示如果自己得到老人失智症，他不願像老人院的失智老人一般活著，最好能快些死去。不幸黃先生退休不久後逐漸出現失智狀況，且經常像小孩般活蹦亂跳，既天真又快樂。某日黃先生在家門前追逐小狗，闖進馬路中央被一輛卡車撞倒，到達急診室時因內出血休克，必須緊急手術。黃先生的女兒向醫師說明父親在心智正常時，曾表達若有失智便不想活的心願，所以不知道該不該簽署手術同意書。下列敘述為醫師選擇處置的方式和理由，其中何者最為合宜？
A. 相信由女兒轉述的父親心願，於是不進行積極治療
B. 請女兒以書面明確陳述父親心願、代替父親簽署放棄積極治療同意書，方可不進行積極治療
C. 因黃先生並未以書面文件明確陳述，故不須理會他先前的心願
D. 因不確認黃先生目前之真正意願，故應積極搶救、等黃先生活下來再說

正確答案：B. 請女兒以書面明確陳述父親心願、代替父親簽署放棄積極治療同意書，方可不進行積極治療